Clinical trial exclusion criterion:
Other protocol defined inclusion/exclusion criteria may apply.

Annotated entities:
- Non-representable: "Other protocol defined inclusion/exclusion criteria may apply."